Clinical trial exclusion criterion:
Woman patients who do not agree to the contraception from baseline to 12 month

Annotated entities:
- Pregnancy_considerations: "Woman patients who do not agree to the contraception from baseline to 12 month"